Clinical trial exclusion criterion:
Use of psychostimulants, anti-depressants, neuroleptics or anti-convulsive agents within the past month.

Annotated entities:
- Drug: "psychostimulants"
- Drug: "anti-depressants"
- Drug: "neuroleptics"
- Drug: "anti-convulsive agents"
- Temporal: "within the past month"